Al administrar oxigenoterapia a un paciente que ingresa en urgencias por presentar EPOC reagudizada, deberá tener en cuenta que:
1. El flujo de oxígeno debe ser elevado, ya que la insuficiencia respiratoria va acompañada de hipoxia.
2. La concentración de oxígeno está condicionada por la situación clínica del paciente.
3. La concentración de oxígeno debe ser igual a la concentración atmosférica, ya que el paciente presenta hipercapnia.
4. El flujo debe ser bajo, ya que la hipoxia es el único estímulo para respirar.
5. El flujo debe ajustarse para conseguir una PO2 superior a 90 mmHg.

Respuesta correcta: 4. El flujo debe ser bajo, ya que la hipoxia es el único estímulo para respirar.